Patient proficient into filling out the questionnaires.

The above is a clinical trial inclusion criterion. Annotated with entity spans:
[Post-eligibility: Patient proficient into filling out the questionnaires.]